Smoke on = 25 days of the past 30 days

The above is a clinical trial inclusion criterion. Annotated with entity spans:
[Observation: Smoke] on [Multiplier: = 25 days of the past 30 days]